Production of sputum

The above is a clinical trial inclusion criterion. Annotated with entity spans:
Production of [Condition: sputum]